The use of butalbital in any form within 4 weeks of beginning the Preliminary Screening Period (P1) through the end of the participant's study involvement is exclusionary.

The above is a clinical trial exclusion criterion. Annotated with entity spans:
The use of [Drug: butalbital] in any form [Temporal: within 4 weeks of beginning the Preliminary Screening Period (P1)] through the end of the participant's study involvement is exclusionary.